En cromatografía de exclusión por tamaños:
1. El volumen hidrodinámico de una molécula está relacionado exponencialmente con el peso molecular del soluto y su volumen de retención.
2. Cuando el tamaño de los solutos se aproxima al tamaño medio de los poros del relleno, éstos penetran o se reparten en los poros y eluyen a un tiempo menor que el tiempo muerto.
3. Los polímeros que no pueden entrar en los poros del relleno eluyen con el volumen de permeación de la columna.
4. En una separación de polímeros de diferente peso molecular, el volumen muerto o de exclusión total es el volumen intersticial total y es el punto en el cromatograma antes del cual ninguna molécula de polímero puede eluir.

Respuesta correcta: 4. En una separación de polímeros de diferente peso molecular, el volumen muerto o de exclusión total es el volumen intersticial total y es el punto en el cromatograma antes del cual ninguna molécula de polímero puede eluir.